Clinical trial exclusion criterion:
2. Were taking a lidocaine-containing product that could not be discontinued while receiving lidocaine

Annotated entities:
- Drug: "lidocaine-containing product"
- Qualifier: "could not be discontinued"
- Temporal: "while receiving lidocaine"
- Drug: "lidocaine"
- Reference_point: "receiving lidocaine"